由鼠疫桿菌（Yersinia pestis）造成的黑死病，可以不同方式傳播，其中人與人之間的主要傳染方式是？
A. 皮膚接觸
B. 輸血傳染
C. 糞便污染水源
D. 飛沫傳染

正確答案：D. 飛沫傳染